一位新生兒一出生就發生嚴重發紺（cyanosis）並被發現有一心室中隔缺損（ventricular septal defect）。 下列先天性心臟病中何者並不符合如此的臨床及病理表現？
A. tetralogy of Fallot
B. tricuspid atresia with hypoplasia of right ventricle
C. atrioventricular septal defect
D. truncus arteriosus

正確答案：C. atrioventricular septal defect